下列有關高齡病人接受麻醉比較容易發生術後譫妄（post-operative delirium）現象之敘述，何者錯誤？
A. 原有視覺或聽覺障礙者發生比例較高
B. 接受骨科或大手術者發生率較高
C. 疼痛控制不良者發生率較高
D. 女性發生率較高

正確答案：D. 女性發生率較高